Clinical trial inclusion criterion:
6. Bilirubin <2x, AST <3x, Serum creatinine <2x upper limit of normal, Hgb >8.0

Entity relations:
- Has_value("Bilirubin", "<2x")
- Has_value("AST", "<3x")
- Has_value("Serum creatinine", "<2x upper limit of normal")
- Has_value("Hgb", ">8.0")